cardiac or non-cardiac illness with life expectancy of less than two years;

The above is a clinical trial exclusion criterion. Annotated with entity spans:
[Condition: cardiac] or [Condition: non-cardiac illness] with [Observation: life expectancy] of [Value: less than two years];